Clinical trial exclusion criterion:
current ongoing psychiatric disorder

Annotated entities:
- Temporal: "current"
- Temporal: "ongoing"
- Condition: "psychiatric disorder"